下列關於 organic nitrates 之敘述何者錯誤？
A. 可使心室 ejection time 增加
B. 可能引發心搏過速，以及鈉離子和水分滯留問題
C. 可使靜脈擴張，血液回流減少，降低心臟的前負荷（pre-load）
D. 可使冠狀動脈擴張，血流重分布至缺血區，改善心絞痛症狀

正確答案：A. 可使心室 ejection time 增加